Hemodynamic stable patient

The above is a clinical trial inclusion criterion. Annotated with entity spans:
[Condition: Hemodynamic stable] patient